Clinical trial exclusion criterion:
16. Women who are breastfeeding or pregnant as evidenced by positive serum pregnancy test

Annotated entities:
- Parsing_Error: "16."
- Observation: "breastfeeding"
- Condition: "pregnant"
- Person: "Women"
- Measurement: "serum pregnancy test"
- Value: "positive"